Thoracoscopic surgery candidate.

The above is a clinical trial inclusion criterion. Annotated with entity spans:
[Procedure: Thoracoscopic surgery] [Mood: candidate].